Any vaccination 2 weeks prior start of the study

The above is a clinical trial exclusion criterion. Annotated with entity spans:
Any [Procedure: vaccination] [Temporal: 2 weeks prior start of the study]